Paciente de 76 años, con hipertensión y diabetes mellitus, que acude a Urgencias porque desde hace 72 horas ha comenzado con un cuadro de palpitaciones y disminución de su capacidad para hacer esfuerzos. A su llegada se documenta una fibrilación auricular con respuesta ventricular en torno a 120 lpm. ¿Cuál de las siguientes opciones es FALSA?:
1. Este paciente debe estar anticoagulado oralmente de por vida, salvo contraindicación.
2. Si decidimos realizar una cardioversión a su llegada a Urgencias, sería necesario hacer previamente una ecocardiografía transesofágica.
3. Al ser el primer episodio de fibrilación auricular es el candidato idóneo para realizar una ablación con catéter.
4. Para frenar la frecuencia cardiaca podríamos emplear betabloqueantes.

Respuesta correcta: 3. Al ser el primer episodio de fibrilación auricular es el candidato idóneo para realizar una ablación con catéter.